Cervical dilatation > 4 cm

The above is a clinical trial exclusion criterion. Annotated with entity spans:
[Measurement: Cervical dilatation] [Value: > 4 cm]